Inability to follow directions or comprehend the English language.

The above is a clinical trial exclusion criterion. Annotated with entity spans:
[Post-eligibility: Inability to follow directions or comprehend the English language].